Clinical trial exclusion criterion:
Nursing homes will not be eligible to participate if they meet the following criteria:

Annotated entities:
- Visit: "Nursing homes"
- Non-representable: "if they meet the following criteria:"